Absence of skin injures, infections or tumor in the target knee;

The above is a clinical trial inclusion criterion. Annotated with entity spans:
[Negation: Absence] of [Condition: skin injures], [Condition: infections] or [Condition: tumor] in the [Reference_point: target knee];